Clinical trial exclusion criterion:
Pregnant woman whose amniocentesis reveals any genetic abnormality

Annotated entities:
- Condition: "Pregnant"
- Person: "woman"
- Procedure: "amniocentesis"
- Value: "genetic abnormality"